Time from onset to treatment =6 hours;

The above is a clinical trial inclusion criterion. Annotated with entity spans:
[Observation: Time from onset to treatment] [Value: =6 hours];